Use of antidepressant medication within 1 month of the pre-treatment PET scan (within 5 weeks for fluoxetine and protryptyline).

The above is a clinical trial exclusion criterion. Annotated with entity spans:
Use of [Drug: antidepressant medication] [Temporal: within 1 month of the pre-treatment PET scan] ([Temporal: within 5 weeks for fluoxetine and protryptyline]).